En relación con los flagelados se denomina pleomorfo
1. El ciclo vital con un solo tipo morfológico.
2. El ciclo vital en el que ocurren varios tipos morfológicos.
3. Al bastoncillo central de sostén que muestran algunos flagelados.
4. Al cuerpo en forma de óvalo o de bastoncillo que se observa en hemoflagelados.

Respuesta correcta: 2. El ciclo vital en el que ocurren varios tipos morfológicos.